Clinical trial inclusion criterion:
Age = 18 years of either gender

Annotated entities:
- Person: "Age"
- Value: "= 18 years"
- Person: "either gender"